Clinical trial exclusion criteria:
current suicidal risk
current psychosis
ongoing trauma (e.g. current involvement in an abusive relationship).

Annotated entities:
- Condition: "suicidal risk"
- Temporal: "current"
- Condition: "psychosis"
- Temporal: "current"
- Condition: "trauma"
- Temporal: "ongoing"
- Condition: "involvement in an abusive relationship"
- Temporal: "current"